下列抗血小板凝集藥物中，何者較易發生 Neutropenia 之不良作用？
A. Clopidogrel
B. Ticlopidine
C. Abciximab
D. Dipyridamole

正確答案：B. Ticlopidine